Clinical trial exclusion criterion:
History of intracranial haemorrhage

Entity relations:
- Has_temporal("intracranial haemorrhage", "History")